Clinical trial exclusion criterion:
Prior cardiac surgery

Annotated entities:
- Procedure: "cardiac surgery"
- Temporal: "Prior"